下列何者不是受傷性腦傷（traumatic brain injury）常見的併發症？
A. 認知能力（cognition）失常
B. 癲癇（seizure）
C. 水腦症（hydrocephalus）
D. 低血壓（hypotension）

正確答案：D. 低血壓（hypotension）